motion sickness.

The above is a clinical trial exclusion criterion. Annotated with entity spans:
[Condition: motion sickness].